Mentally handicapped.

The above is a clinical trial exclusion criterion. Annotated with entity spans:
[Condition: Mentally handicapped].